一位 5 歲男童，主訴這 1 星期開始，尿尿泡泡很多，理學檢查發現全身水腫，血壓正常。尿液檢查發現 protein: 3+，血液檢查發現Albumin: 2.3 g/dL, Total Calcium: 7.5 mg/dL, Cholesterol: 356 mg/dL, Triglyceride:  mg/dL。下列敘述何者錯誤？
A. 最可能的診斷是微小變化型腎病變（minimal change nephropathy）
B. 病童有可能會抽筋
C. 蛋白尿緩解後，血脂自然會下降
D. 病童若腹痛，要排除腹膜炎之可能性

正確答案：B. 病童有可能會抽筋